小型肝癌（small hepatocellular carcinoma）最常見的症狀為何？
A. 通常沒有症狀
B. 腹水
C. 黃疸
D. 吐血

正確答案：A. 通常沒有症狀